Patients with active or suspected acute or chronic uncontrolled infection including abcesses or fistulae

The above is a clinical trial exclusion criterion. Annotated with entity spans:
Patients with [Qualifier: active] or [Qualifier: suspected] [Qualifier: acute] or [Qualifier: chronic] [Condition: uncontrolled infection] including [Condition: abcesses] or [Condition: fistulae]